李先生，47 歲，最近一個月來逐漸感覺有吞嚥困難現象，無法進食固體食物，且體重消瘦 2 公斤。李先生平常有抽菸、喝酒習慣。李先生經一系列檢查，證實罹患食道鱗狀上皮癌，有關食道癌，下列何者是最正確答案？
A. 以放射治療為主
B. 以位於胸部食道中段最多
C. 食道切除後，以小腸重建最常見
D. 東方人食道癌，組織病理以腺癌最常見

正確答案：B. 以位於胸部食道中段最多